Según el mecanismo de Frank-Starling del corazón, en condiciones fisiológicas el gasto cardíaco es directamente proporcional a:
1. El tamaño del ventrículo.
2. La frecuencia cardíaca.
3. El retorno venoso.
4. El grosor del miocardio.
5. Todas las respuestas anteriores son correctas.

Respuesta correcta: 3. El retorno venoso.